下列何者為合法之醫療廣告？
A. 藉摘錄醫學刊物內容宣傳
B. 利用贈與醫療刊物宣傳
C. 宣傳醫療院所擅長之專業診療科別
D. 以公開答問方式宣傳

正確答案：C. 宣傳醫療院所擅長之專業診療科別